The patients are in some special conditions that they can't understand the written informed consent, such as they are demented or hawkish.

The above is a clinical trial exclusion criterion. Annotated with entity spans:
[Post-eligibility: The patients are in some special conditions that they can't understand the written informed consent, such as they are demented or hawkish.]